下列何者與真核細胞轉錄作用無關？
A. DNA模板（DNA template）
B. RNA聚合酶（RNA polymerase）
C. RNA引子（RNA primer）
D. 啟動子（promoter）

正確答案：C. RNA引子（RNA primer）